Current treatment with weekly individual or group psychotherapy of any type targeted at depressive symptoms.

The above is a clinical trial exclusion criterion. Annotated with entity spans:
Current treatment with [Multiplier: weekly] [Qualifier: individual] or [Qualifier: group] [Procedure: psychotherapy] of any type targeted at [Condition: depressive symptoms].